Clinical trial inclusion criterion:
Confirmed presence of iron deficiency

Entity relations:
- multi("iron deficiency", "iron")